pelvic pain or pelvic pressure

The above is a clinical trial inclusion criterion. Annotated with entity spans:
[Condition: pelvic pain] or [Condition: pelvic pressure]